Clinical trial exclusion criterion:
Past history of breast cancer within recent 5 years before the currently diagnosed breast cancer.

Entity relations:
- Has_temporal("breast cancer", "recent 5 years before the currently diagnosed breast cancer")
- Has_index("recent 5 years before the currently diagnosed breast cancer", "currently diagnosed breast cancer.")